Los ácidos sulfónicos se convierten en cloruros de sulfonilo por tratamiento con:
1. Cloruro de metileno.
2. Cloro.
3. Cloruro sódico.
4. Cloruro de tionilo.
5. Cloroformo.

Respuesta correcta: 4. Cloruro de tionilo.